Clinical trial inclusion criterion:
Is healthy on the basis of physical examination, medical history, electrocardiogram (ECG), and vital signs measurement performed at screening

Annotated entities:
- Condition: "healthy"
- Procedure: "electrocardiogram (ECG)"
- Temporal: "medical history"
- Procedure: "physical examination"
- Procedure: "vital signs measurement"
- Temporal: "at screening"